Los aminoácidos cetogénicos:
1. Podrán contribuir a la síntesis de glucosa.
2. Son intermediarios del ciclo de la urea.
3. Son el sustrato de reacciones catalizadas por transcetolasas.
4. Pueden producir acetil-coenzima A.
5. Se eliminan en forma de cetosas.

Respuesta correcta: 4. Pueden producir acetil-coenzima A.